Clinical trial exclusion criterion:
Cicatricial meibomian gland dysfunction

Annotated entities:
- Qualifier: "Cicatricial"
- Condition: "meibomian gland dysfunction"